Clinical trial exclusion criterion:
Long-standing persistent or permanent atrial fibrillation.

Annotated entities:
- Condition: "atrial fibrillation"
- Qualifier: "persistent"
- Qualifier: "permanent"